60歲男性，因為車禍造成脾臟破裂失血，臨床表現皮膚乾燥、無尿、血壓下降，經手術、輸血及體液補充後，症狀改善，在病程中所導致的器官變化，下列何者最易發生？
A. 肝臟廣泛性壞死
B. 急性腎小管壞死
C. 瀰漫性肺泡壞死
D. 腎上腺皮質細胞中脂肪堆積

正確答案：B. 急性腎小管壞死